Clinical trial inclusion criterion:
The capacity to provide informed consent.

Annotated entities:
- Non-query-able: "The capacity to provide informed consent."